La existencia de una asociación estadística significativa entre variables ordinales puede determinarse, más adecuadamente, mediante:
1. El test de Kuskal-Wallis.
2. La correlación de Pearson.
3. El test de Kappa.
4. La correlation de Spearman.

Respuesta correcta: 4. La correlation de Spearman.